Clinical trial exclusion criterion:
Renal failure not due to LAL

Entity relations:
- Has_negation("LAL", "not")
- Has_mood("LAL", "due to")
- AND("LAL", "Renal failure")